Clinical trial exclusion criterion:
Subject has permanent pacemaker or defibrillator implant.

Entity relations:
- OR("permanent pacemaker", "defibrillator implant")